肚臍的皮節（dermatome）是：
A. L1
B. T12
C. T10
D. T8

正確答案：C. T10